Clinical trial exclusion criteria:
Any intraocular inflammation in the study eye present during the screening slit lamp examination
Score greater than "0" on the Ocular Pain Assessment in the study eye at Screening
Any intraocular inflammation in the study eye present during the screening slit lamp examination

Annotated entities:
- Value: "intraocular inflammation"
- Temporal: "during the screening slit lamp examination"
- Reference_point: "the screening slit lamp examination"
- Procedure: "slit lamp examination"
- Condition: "intraocular inflammation"
- Measurement: "Ocular Pain Assessment"
- Value: "greater than "0""
- Temporal: "at Screening"
- Condition: "intraocular inflammation"
- Temporal: "during the screening slit lamp examination"
- Reference_point: "the screening slit lamp examination"
- Procedure: "slit lamp examination"
- Value: "intraocular inflammation"